一位 74 歲男性，10 年前開始覺得排尿愈來愈困難，特別是在開始排尿及結束時。最近甚至一個晚上需起身數次排尿，但尿量並不多。身體檢查發現他的攝護腺為正常的兩倍大，但並不會有壓痛情形。他去年與今年皆曾接受 prostatic specific antigen 檢測，結果均稍高。他的攝護腺最可能出現何種變化？
A. 明顯的嗜中性白血球浸潤
B. 分化不佳的腺體不規則排列在纖維組織中
C. 由腺體與間質細胞構成的增生性結節
D. 具乾酪性壞死肉芽腫發炎反應

正確答案：C. 由腺體與間質細胞構成的增生性結節